Subject must have been previously immunized for smallpox, at =3 years prior to commencement of screening assessments, and vaccination history must be confirmed by oral or written history and the presence of a visible pathognomonic smallpox vaccination scar.

The above is a clinical trial inclusion criterion. Annotated with entity spans:
Subject must have been previously [Procedure: immunized] for [Condition: smallpox], at =[Temporal: 3 years prior to commencement of screening assessments], [Non-query-able: and vaccination history must be confirmed by oral or written history and the presence of a visible pathognomonic smallpox vaccination] scar.